關於診斷性子宮鏡，下列敘述何者正確？
A. 它是所有不孕症者評估的一部分
B. 因為病患不適，診斷性子宮鏡不能在門診施行
C. 子宮鏡在診斷子宮腔內的病灶上優於子宮內膜刮搔術（D&C）和子宮輸卵管攝影（HSG）
D. 有經血過多者，不適合做子宮鏡檢查

正確答案：C. 子宮鏡在診斷子宮腔內的病灶上優於子宮內膜刮搔術（D&C）和子宮輸卵管攝影（HSG）